下列敘述何者正確？
A. 藥物需解離為離子型態較容易通過細胞膜而吸收
B. 解離藥物易溶於脂類而與蛋白質結合
C. 酸性藥物若使用 NaHCO3 鹼化尿液，會促進該藥物在腎小管之再吸收
D. 藥物之吸收率受吸收部位之 pH 值及藥物 pKa 值之影響

正確答案：D. 藥物之吸收率受吸收部位之 pH 值及藥物 pKa 值之影響